所謂的 Norwood 術式包括主動脈弓的重建，使體循環血流出口無阻塞，同時利用改良性的 Blalock-Taussig 分流術來控制肺動脈血流，這個術式最適用於下列何種疾病？
A. 主動脈弓中斷合併心室中隔缺損
B. 主動脈窄縮症合併心室中隔缺損
C. 二尖瓣閉鎖症（mitral atresia）
D. 三尖瓣閉鎖症（tricuspid atresia）

正確答案：C. 二尖瓣閉鎖症（mitral atresia）